在 Lesch-Nyhan syndrome 中除了尿酸昇高外，血液及尿液中還有那一種物質昇高？
A. Hypoxanthine
B. Inosine 5'-hypoxanthine
C. Guanosine 5'-monophosphate
D. ATP

正確答案：A. Hypoxanthine